Clinical trial exclusion criterion:
Bilateral Lower extremity involvement of the suspected infection.

Annotated entities:
- Condition: "infection"
- Qualifier: "Bilateral Lower extremity"